Clinical trial inclusion criterion:
2. Patients who are eligible for coronary revascularization (angioplasty or CABG);

Entity relations:
- Has_mood("coronary revascularization", "eligible for")
- Subsumes("coronary revascularization", "angioplasty")
- OR("angioplasty", "CABG")